Clinical trial exclusion criterion:
Exclusion for monitoring difficulties (mutation, insufficient motivation, priority associated pathology in care)

Annotated entities:
- Non-representable: "Exclusion for monitoring difficulties (mutation, insufficient motivation, priority associated pathology in care)"